Clinical trial exclusion criterion:
People with hypersensitivity to local amide-type anesthetics

Annotated entities:
- Condition: "hypersensitivity"
- Drug: "local amide-type anesthetics"